根據目前證據，下列那一個癌症與病毒或細菌感染最不相關？
A. 鼻咽癌（nasopharyngeal cancer）
B. 結腸癌（colon cancer）
C. 胃癌（gastric cancer）
D. 子宮頸癌（cervical cancer）

正確答案：B. 結腸癌（colon cancer）